Un paciente con antecedentes de hipertensión bien controlada con medicación va a ser intervenido de una colecistectomía. ¿Qué riesgo anestésico encontraremos en su informe de preanestesia?:
1. ASA I.
2. ASA II.
3. ASA III.
4. ASA IV.

Respuesta correcta: 2. ASA II.